在脊髓損傷急性期，最容易發生壓瘡（pressure ulcer）之部位為何？
A. 坐骨（ischium）
B. 薦骨（sacrum）
C. 股骨大轉子（greater trochanter）
D. 足跟（heel）

正確答案：B. 薦骨（sacrum）